Clinical trial inclusion criteria:
Women with a singleton pregnancy undergoing cesarean section after 37 weeks of gestation.

Annotated entities:
- Condition: "singleton pregnancy"
- Procedure: "cesarean section"
- Value: "after 37 weeks"
- Measurement: "gestation"